Clinical trial exclusion criterion:
Participation in any other clinical study within the last 3 months.

Entity relations:
- Has_qualifier("Participation in clinical study", "any other")
- Has_temporal("Participation in clinical study", "within the last 3 months")